Clinical trial exclusion criterion:
Resistant hypertension, defined as BP > 140/90, despite the use of three or more anti-hypertensive drugs

Annotated entities:
- Condition: "hypertension"
- Qualifier: "Resistant"
- Measurement: "BP"
- Value: "> 140/90"
- Qualifier: "despite the use of three or more anti-hypertensive drugs"
- Drug: "anti-hypertensive drugs"
- Multiplier: "three or more"